Clinical trial inclusion criterion:
Age >/= 18 years

Entity relations:
- Has_value("Age", ">/= 18 years")